Clinical trial exclusion criterion:
Concurrent clinical diagnosis that significantly could affect test performance.

Annotated entities:
- Non-query-able: "Concurrent clinical diagnosis that significantly could affect test performance"